Clinical trial exclusion criterion:
Treated with intramuscular or intravenous corticosteroids in the last 6 months for RA activity

Annotated entities:
- Qualifier: "intramuscular"
- Qualifier: "intravenous"
- Drug: "corticosteroids"
- Temporal: "in the last 6 months"
- Condition: "RA"